7. St.Jonh's Wort

The above is a clinical trial exclusion criterion. Annotated with entity spans:
[Parsing_Error: 7.] [Drug: St.Jonh's Wort]